下列何者，與心肌細胞不具有強直性收縮（tetanic contraction）的特質最有關？
A. L-type 鈣離子通道（Ca2+ channel）
B. ATP-sensitive 鉀離子通道（K+ channel）
C. dihydropyridine receptor
D. ryanodine receptor

正確答案：A. L-type 鈣離子通道（Ca2+ channel）